Clinical trial exclusion criterion:
Subjects with a current DSM-<U+2163>-TR or 5 diagnosis other than schizophrenia, including schizoaffective disorder, major depressive disorder, bipolar disorder, delirium, dementia, amnesia, Borderline, Paranoid, Histrionic, Schizotypal, Schizoid, Antisocial or other cognitive or personality disorders.

Annotated entities:
- Qualifier: "DSM-<U+2163>-TR"
- Condition: "schizophrenia"
- Negation: "other than"
- Qualifier: "DSM- 5"
- Condition: "schizoaffective disorder"
- Condition: "major depressive disorder"
- Condition: "bipolar disorder"
- Condition: "delirium"
- Condition: "dementia"
- Condition: "amnesia"
- Condition: "Borderline disorders"
- Condition: "Paranoid disorders"
- Condition: "Histrionic disorders"
- Condition: "Schizotypal disorders"
- Condition: "Schizoid disorders"
- Condition: "Antisocial disorders"
- Qualifier: "other"
- Condition: "cognitive disorders"
- Condition: "personality disorders"